Clinical trial exclusion criterion:
Significant liver disease: liver enzymes 2.5 folds the upper normal limit

Annotated entities:
- Condition: "liver disease"
- Measurement: "liver enzymes"
- Value: "2.5 folds the upper normal limit"
- Qualifier: "Significant"